Clinical trial exclusion criterion:
1. Had a neurological condition other than that associated with their pain diagnosis which, in the opinion of the investigator, would interfere with their ability to participate in the study

Annotated entities:
- Condition: "neurological condition"
- Condition: "pain diagnosis"
- Negation: "other than"
- Qualifier: "associated with their pain diagnosis"
- Undefined_semantics: "in the opinion of the investigator"